Clinical trial inclusion criterion:
Must be capable of giving written informed connect for participation in the study for 24 months.

Annotated entities:
- Post-eligibility: "Must be capable of giving written informed connect for participation in the study for 24 months."